Undergoing major cardiac surgery using cardiopulmonary bypass

The above is a clinical trial inclusion criterion. Annotated with entity spans:
Undergoing [Procedure: major cardiac surgery] using [Procedure: cardiopulmonary bypass]